一位 30 歲婦女過去有泌尿道發炎的病史，現在主訴有頻尿、解尿疼痛和下肢酸痛的症狀，下列何種致病的菌種最有可能引起上述症狀？
A. Staphylococcus saprophyticus
B. Escherichia coli
C. Klebsiella pneumoniae
D. Proteus mirabilis

正確答案：B. Escherichia coli